Combined P-glycoprotein inducer and strong CYP 3A4 inducer

The above is a clinical trial exclusion criterion. Annotated with entity spans:
Combined [Drug: P-glycoprotein inducer] and [Qualifier: strong] [Drug: CYP 3A4 inducer]